Clinical trial exclusion criterion:
Patients who had taken PPI, H2 receptor antagonists and antibiotics within 4 weeks

Entity relations:
- Has_temporal("PPI", "within 4 weeks")
- Has_temporal("and", "within 4 weeks")
- OR("PPI", "H2 receptor antagonists", "antibiotics")